Clinical trial exclusion criterion:
Evidence of any GI disorder induced by an infection, underlying medical condition, or concomitant medication other than MPA

Annotated entities:
- Condition: "GI disorder"
- Qualifier: "induced by an infection"
- Condition: "infection"
- Condition: "underlying medical condition"
- Drug: "medication"
- Drug: "MPA"
- Negation: "other than"